Clinical trial exclusion criterion:
Current treatment with prednisone/prednisolone and/or immunosuppressive medication for an indication other than autoimmune hepatitis

Annotated entities:
- Drug: "prednisone"
- Drug: "prednisolone"
- Drug: "immunosuppressive medication"
- Condition: "autoimmune hepatitis"
- Negation: "other"
- Condition: "indication"